A un hombre de 55 años, padre de un hijo celiaco, con anemia ferropénica y aumento reciente del ritmo deposicional, se le ha realizado una determinación de los alelos HLA-DQ2 y HLADQ8 que ha resultado negativa. ¿Qué estudio diagnóstico es el más apropiado en este caso?
1. Determinación de anticuerpos antitransglutaminasa IgA.
2. Endoscopia digestiva alta con toma de biopsias duodenales.
3. Test de D-xilosa.
4. Evaluar la respuesta a dieta sin gluten.
5. Colonoscopia.

Respuesta correcta: 5. Colonoscopia.